Clinical trial inclusion criterion:
All patients must be prohibited donation during the treatment process and in 28 days after treatment;

Annotated entities:
- Negation: "prohibited"
- Procedure: "donation"
- Temporal: "during the treatment process"
- Reference_point: "treatment"
- Temporal: "in 28 days after treatmen"
- Reference_point: "treatment"